Healthy adults 18-45 years of age

The above is a clinical trial inclusion criterion. Annotated with entity spans:
[Condition: Healthy] [Person: adults] [Value: 18-45 years of age]